有關急性膽囊炎及Murphy sign，下列敘述何者正確？①急性膽囊炎常合併黃疸現象 ②為急性膽囊炎的 pathognomonic sign
 ③深度按壓右胸下的上腹部時，會讓深吸氣突然停止 ④深度按壓右胸下的上腹部時，會讓深呼氣突然停止
 ⑤急性膽囊炎大部分可藉由保守性非手術療法獲得緩解
A. ①②③
B. ①②④
C. ②③⑤
D. ②④⑤

正確答案：C. ②③⑤